一位 25 歲女性，陰道生產後發生產後大出血（postpartum hemorrhage），產後無泌乳，6 個月後亦無正常月經，下列何者為最有可能之血中荷爾蒙變化？
A. 高性腺刺激素之性腺機能低下（hypergonadotropic hypogonadism）
B. 低性腺刺激素之性腺機能低下（hypogonadotropic hypogonadism）
C. 正常（eugonadism）
D. 泌乳激素過高

正確答案：B. 低性腺刺激素之性腺機能低下（hypogonadotropic hypogonadism）